Which domain of the MOZ/MYST3 protein complex associates with histone H3?

The double PHD finger domain of MOZ/MYST3 induces a-helical structure of the histone H3 tail